Clinical trial exclusion criterion:
unstable condition on anti-parkinsonian medications;

Entity relations:
- AND("unstable condition", "anti-parkinsonian medications")